Clinical trial exclusion criteria:
Surgeries that include: intradetrusor Botox, vaginal mesh excision, and fistula repair
Pregnancy
History of nephrolithiasis
Allergy to study medications
Congenital urogenital anomaly
Neurogenic bladder

Annotated entities:
- Drug: "Botox"
- Qualifier: "intradetrusor"
- Procedure: "vaginal mesh excision"
- Device: "vaginal mesh"
- Procedure: "fistula repair"
- Condition: "Pregnancy"
- Condition: "nephrolithiasis"
- Temporal: "History"
- Condition: "Allergy"
- Drug: "study medications"
- Qualifier: "Congenital"
- Condition: "urogenital anomaly"
- Condition: "Neurogenic bladder"